Which genes are the main markers of primitive Endoderm (prEN) formation?

The markers of primitive endoderm (prEN) formation are the transcriptional activators fgf4 and its ligand, lrp2, gata4, pdgfra, p dgfrα, gATA6, nanog, pDgfralpha, egam1 and dab2.